pulmonary hypertension

The above is a clinical trial exclusion criterion. Annotated with entity spans:
[Condition: pulmonary hypertension]